What can be isolated from Pleurotus mutilus?

Pleuromutilins are antibiotics,  isolated from the fungus,  Pleurotus mutilus, that selectively inhibit bacterial translation and are semisynthetic derivatives of the naturally occurring tricyclic diterpenoid pleuromutilins.